Clinical trial exclusion criterion:
patients with chronic treatment with oral corticosteroids without stabilized pattern.

Annotated entities:
- Drug: "oral corticosteroids"